Previously treated patients, with failure or intolerance to first-line therapy, or relapse after first-line therapy, i.e. corticosteroids, intravenous immunoglobulin (IVIG), or anti-D immunoglobulins

The above is a clinical trial inclusion criterion. Annotated with entity spans:
[Observation: Previously treated] patients, with [Qualifier: failure] or [Qualifier: intolerance] to [Procedure: first-line therapy], or [Condition: relapse] [Temporal: after first-line therapy], i.e. [Drug: corticosteroids], [Drug: intravenous immunoglobulin] ([Drug: IVIG]), or [Drug: anti-D immunoglobulins]